18-65 years old

The above is a clinical trial inclusion criterion. Annotated with entity spans:
[Value: 18-65] [Person: years old]